Clinical trial exclusion criterion:
Patients presenting with gastroesophageal reflux disease, peptic ulcer.

Annotated entities:
- Condition: "gastroesophageal reflux disease"
- Condition: "peptic ulcer"